Clinical trial inclusion criterion:
Ischemic symptoms or evidence of myocardial ischemia (inducible or spontaneous) in the presence of >50% de novo stenosis located in native coronary vessels

Annotated entities:
- Condition: "Ischemic symptoms"
- Mood: "evidence"
- Condition: "myocardial ischemia"
- Qualifier: "inducible"
- Qualifier: "spontaneous"
- Value: ">50%"
- Qualifier: "de novo"
- Measurement: "stenosis"
- Condition: "stenosis"
- Qualifier: "native coronary vessels"